Clinical trial inclusion criterion:
History of scleroderma

Annotated entities:
- Temporal: "History"
- Condition: "scleroderma"